clinically significant medical or neurologic condition or neurocognitive dysfunction that would affect function and/or task performance and/or interfere with the study protocol

The above is a clinical trial exclusion criterion. Annotated with entity spans:
[Qualifier: clinically significant] [Condition: medical] or [Condition: neurologic condition] or [Condition: neurocognitive dysfunction] that would affect function and/or task performance and/or interfere with the study protocol